Clinical trial exclusion criterion:
Absolute indication for anti-platelet therapy

Annotated entities:
- Procedure: "anti-platelet therapy"
- Mood: "Absolute indication for"